某女士患有退化性骨關節炎數年，檢查時並無關節腫脹（swelling）或局部發熱。上下樓梯時膝關節疼痛程度增加，且最近走路耐力逐漸減少。最適合接受下列何種復健治療？
A. 冷敷＋電療＋爬階梯訓練（cold packing＋electrotherapy＋climbing steps exercise）
B. 冷熱交替治療（alternate cold and heat therapy）
C. 熱敷＋電療＋水療（hot packing＋electrotherapy＋hydrotherapy）
D. 熱敷＋電療＋腳踏車訓練（hot packing＋electrotherapy＋cycling exercise）

正確答案：D. 熱敷＋電療＋腳踏車訓練（hot packing＋electrotherapy＋cycling exercise）